下列何處受損，最可能導致病患喪失原先已經會使用刀叉吃東西的能力？
A. primary motor cortex
B. supplementary motor area
C. premotor cortex
D. posterior parietal cortex

正確答案：D. posterior parietal cortex